Clinical trial inclusion criterion:
Must have had a treatment-free interval of greater than 6 months following response to platinum.

Annotated entities:
- Condition: "a treatment-free interval"
- Temporal: "greater than 6 months following response to platinum"
- Reference_point: "response to platinum"
- Drug: "platinum"